Clinical trial exclusion criterion:
Current unstable medical condition (e.g. unstable angina, myocardial infarction or coronary revascularization in the preceding 12 months, cardiac failure, chronic renal failure, chronic hepatic disease, severe pulmonary disease, blood disorders, poorly controlled diabetes, chronic infection)

Annotated entities:
- Condition: "unstable medical condition"
- Qualifier: "unstable"
- Temporal: "Current"
- Condition: "unstable angina"
- Condition: "myocardial infarction"
- Procedure: "coronary revascularization"
- Temporal: "in the preceding 12 months"
- Condition: "cardiac failure"
- Condition: "chronic renal failure"
- Condition: "chronic hepatic disease"
- Condition: "pulmonary disease"
- Condition: "blood disorders"
- Condition: "diabetes"
- Qualifier: "controlled"
- Negation: "poorly"
- Condition: "chronic infection"
- Qualifier: "chronic"
- Qualifier: "severe"
- Qualifier: "chronic"
- Qualifier: "chronic"